賴先生是一位 86 歲的退休公務人員，左側下肢於三年前因周邊血管阻塞疾病，於他院施行膝下截肢，能夠使用義肢行走。這次因右足冰冷、潰瘍不癒住院擬接受股動脈繞道手術。預定開刀日當天凌晨四時左右，護理人員發現遺書、雙側手腕有邊緣整齊的傷口、大量出血、意識不清，收縮壓 40 mmHg、舒張壓測不到，經彈性繃帶壓迫止血、氣管內插管、輸液急救、轉送加護病房，血壓回穩後，下列處置順序何者最為恰當？
A. 手術探查雙側手腕傷口，縫合修補斷裂的血管、神經、肌腱後，不論如何必須進行原訂的繞道手術
B. 先照會精神科醫師，釐清其自殺意圖，取消所有手術
C. 手術探查雙側手腕傷口，縫合修補斷裂的血管、神經、肌腱，照會精神科醫師，再評估血管繞道手術之適當時機
D. 按照原訂計畫先進行右下肢的血管繞道手術後，再進行手腕傷口縫合修補手術

正確答案：C. 手術探查雙側手腕傷口，縫合修補斷裂的血管、神經、肌腱，照會精神科醫師，再評估血管繞道手術之適當時機